Elective Cardiac surgery

The above is a clinical trial inclusion criterion. Annotated with entity spans:
[Device: Elective Cardiac surgery]